在脊柱形成時，胚胎初期出現的脊索（notochord）最後的發育結果是：
A. 骨化並成為椎骨的一部分
B. 轉變為滑液關節（synovial joint）
C. 構成軟骨關節
D. 退化並侷限在椎間盤內

正確答案：D. 退化並侷限在椎間盤內